Clinical trial exclusion criterion:
Bare-metal stent implantation within 1 month prior to TAVI procedure;

Entity relations:
- Has_index("within 1 month prior to TAVI procedure", "TAVI procedure")
- AND("implantation", "Bare-metal stent")
- Has_temporal("implantation", "within 1 month prior to TAVI procedure")
- multi("TAVI procedure", "TAVI procedure")